A君在林教授指導下，花了半年時間寫了一篇有關兒童尿路感染的論文，第一次投稿到某雜誌後被退稿，理由是收集尿液與診斷尿路感染的標準有誤，林教授要A君依據審稿者的指示標準，造假數據改寫論文後投到另一知名雜誌，下列何種做法最好？
A. 若林教授做通訊作者（負責人），造假的部分就屬他的責任
B. 這論文還是有其他價值，部分造假無傷大雅
C. 婉拒造假，A君與林教授試投其他雜誌
D. 個人退出作者群，將論文交給林教授全權處理

正確答案：C. 婉拒造假，A君與林教授試投其他雜誌